Clinical trial exclusion criterion:
Planned pleurodesis

Annotated entities:
- Condition: "pleurodesis"
- Non-query-able: "Planned pleurodesis"